下列關於ATP synthase的敘述，何者錯誤？
A. 位於粒線體內膜
B. 使用粒線體內膜兩側的氫離子濃度差合成ATP
C. ATP會在粒線體內膜及外膜之間的間隙中形成
D. 合成ATP的過程中涉及ATP synthase之四級結構變化

正確答案：C. ATP會在粒線體內膜及外膜之間的間隙中形成